Clinical trial exclusion criterion:
Participation in other interventional clinical trials, including those with other investigational agents not included in this trial, within 30 days of the start of this trial and throughout the duration of this trial. Non-interventional trials (that is, observational trials) are permitted at any time point.

Annotated entities:
- Competing_trial: "Participation in other interventional clinical trials"
- Temporal: "within 30 days of the start of this trial"
- Temporal: "throughout the duration of this trial"
- Reference_point: "the start of this trial"
- Reference_point: "the duration of this trial"